Entre los componentes característicos del sistema inmunitario adaptativo están:
1. Las células epiteliales.
2. Los macrófagos.
3. Los linfocitos NK.
4. La proteína C reactiva.
5. Los linfocitos B.

Respuesta correcta: 5. Los linfocitos B.